Clinical trial exclusion criterion:
Current or past (within the last 5 years) malignant neoplasms (except basal cell and squamous cell skin carcinoma)

Entity relations:
- Subsumes("past", "within the last 5 years")
- Has_temporal("malignant neoplasms", "Current")
- Has_negation("basal cell carcinoma", "except")
- AND("malignant neoplasms", "basal cell carcinoma")
- OR("Current", "past")
- OR("basal cell carcinoma", "squamous cell skin carcinoma")